Una mujer de 59 años con antecedentes personales de cáncer de mama intervenida hace 8 meses y osteoporosis, sufre una caída y tiene una fractura de cuello de fémur derecho. Es intervenida quirúrgicamente y permanece ingresada en reposo con escayola durante 10 días. A la semana siguiente de su alta nota de forma súbita falta de aire que la lleva a consultar a su médico de cabecera que nota que su pantorrilla derecha tiene edema y dolor a la palpación. ¿Qué elementos clínicos NO serían importantes a la hora de determinar que tiene un riesgo clínico alto de padecer una tromboembolia pulmonar?:
1. El antecedente de cáncer de mama.
2. La historia de osteoporosis.
3. El antecedente de haber estado mas de 3 días en reposo.
4. La presencia de edema unilateral de la pantorrilla derecha.

Respuesta correcta: 2. La historia de osteoporosis.